History of severe pulmonary disease.

The above is a clinical trial exclusion criterion. Annotated with entity spans:
[Temporal: History] of [Condition: severe pulmonary disease].